List the drug targets of Faricimab?

Faricimab is a bispecific antibody that has been developed as an inhibitor of both VEGF and Ang2